下列有關顳下頜關節（temporomandibular joint）之敘述，何者錯誤？
A. 翼內肌（medial pterygoid muscle）協助張口
B. 翼內肌與翼外肌皆協助將下頜骨（mandible）移向對側邊（contralateral side）
C. 部分翼外肌附著於顳下頜關節之關節盤（articular disc）
D. 顳下頜關節位於下頜窩（mandibular fossa）及下頜骨之髁突（condylar process）之間

正確答案：A. 翼內肌（medial pterygoid muscle）協助張口